Clinical trial inclusion criteria:
Pregnant women admitted to Women health hospital with a diagnosis of severe pre-eclampsia

Annotated entities:
- Condition: "Pregnant"
- Person: "women"
- Procedure: "admitted to"
- Visit: "Women health hospital"
- Qualifier: "severe"
- Condition: "pre-eclampsia"